Clinical trial inclusion criterion:
Fasting glucose < 7,0 mM, HbA1c < 48 mmol/mol 3 months after RYGB

Annotated entities:
- Measurement: "Fasting glucose"
- Value: "< 7,0 mM"
- Measurement: "HbA1c"
- Value: "< 48 mmol/mol"
- Temporal: "3 months after RYGB"
- Reference_point: "RYGB"
- Procedure: "RYGB"